Cognitive impairment according to MiniCog

The above is a clinical trial exclusion criterion. Annotated with entity spans:
[Condition: Cognitive impairment] according to [Procedure: MiniCog]